La expresión “hipertensión de bata blanca” hace referencia a:
1. La que caracteriza a los médicos y otros profesionales sanitarios como consecuencia de sus altos niveles de estrés laboral.
2. La que caracteriza a personas de alto nivel socioeconómico.
3. La que caracteriza a ejecutivos y personas que trabajan en el ámbito de los negocios.
4. La que muestran algunos pacientes en el mismo instante en que el médico les está evaluando.

Respuesta correcta: 4. La que muestran algunos pacientes en el mismo instante en que el médico les está evaluando.